關於中樞神經興奮劑 methylphenidate 的敘述，下列何者錯誤？
A. 可用於治療注意力不足過動症
B. 常見的副作用有食慾不振，睡眠障礙，頭痛，不自主運動等
C. 可減少中樞神經系統多巴胺（dopamine）的釋放
D. 目前除了短效劑型中樞神經興奮劑，也有長效劑型可以選擇

正確答案：C. 可減少中樞神經系統多巴胺（dopamine）的釋放